Clinical trial exclusion criterion:
Age less than 18 yrs

Entity relations:
- Has_value("Age", "less than 18 yrs")